一位 48 歲男性肺癌末期病人，因呼吸困難住院，身體檢查病人全身消瘦、左側肺部呼吸聲音下降。 下列那一種不是合理的處理？
A. 血中白蛋白 2.2 g/dL，予以補充白蛋白
B. 胸部 X 光檢查發現左胸大量肋膜積水，予以肋膜抽水
C. 給予嗎啡以減少呼吸困難症狀
D. 抽血檢查血紅素 8.2 g/dL，予以輸濃縮紅血球 2 單位

正確答案：A. 血中白蛋白 2.2 g/dL，予以補充白蛋白